有關 achalasia 接受食道張力測試之結果，下列敘述何者為非？
A. aperistalsis of esophageal body
B. loss of lower esophageal sphincter (LES) relaxation
C. decreased LES pressure
D. increased LES pressure

正確答案：C. decreased LES pressure